Clinical trial inclusion criterion:
Symptomatic or asymptomatic coronary artery disease patients

Annotated entities:
- Qualifier: "asymptomatic"
- Condition: "coronary artery disease"
- Qualifier: "Symptomatic"